Meet at least one other criterion of the Rome-IV criteria for idiopathic constipation based on the 3-week defecation diary (1)

The above is a clinical trial inclusion criterion. Annotated with entity spans:
Meet [Multiplier: at least one] [Qualifier: other] [Condition: criterion] of the [Measurement: Rome-IV criteria for idiopathic constipation] based on the [Procedure: 3-week defecation diary] (1)